胰島素可經由MAP kinase cascade影響其調控基因的表現，參與的訊息傳遞分子依其作用之先後排序，下列何者正確？
A. insulin receptor，IRS-1，Grb2-Sos，Ras-Raf-1，MEK，ERK
B. insulin receptor，Ras-Raf-1，Grb2-Sos，ERK，IRS-1，MEK
C. insulin receptor，Grb2-Sos，Ras-Raf-1，MEK，IRS-1，ERK
D. insulin receptor，IRS-1，Grb2-Sos，Ras-Raf-1，ERK，MEK

正確答案：A. insulin receptor，IRS-1，Grb2-Sos，Ras-Raf-1，MEK，ERK